Clinical trial exclusion criterion:
Regular use of narcotic analgesics (>2 doses per week).

Entity relations:
- Subsumes("Regular use", ">2 doses per week")
- Has_multiplier("narcotic analgesics", "Regular use")